Clinical trial exclusion criterion:
Unsuitable patients judged by investigator

Annotated entities:
- Non-query-able: "Unsuitable patients judged by investigator"